Clinical trial inclusion criterion:
Diagnosed by preoperative imaging modalities to have a brain tumor (including metastatic brain tumors) or vascular lesions (aneurysm, arteriovenous malformation or arteriovenous fistula) requiring surgical intervention.

Entity relations:
- Has_temporal("imaging modalities", "preoperative")
- AND("brain tumor", "imaging modalities")
- Subsumes("brain tumor", "metastatic brain tumors")